Clinical trial inclusion criterion:
Are currently managed at home (outpatients), are ambulatory and able to travel to the clinic. Subjects can be treated with all relevant COPD medication. This includes vaccines, inhaled short-acting beta-2-agonists as needed, short-acting or long-acting anticholinergics (tiotropium), systemic beta-2-agonists, theophylline, mucolytics, antioxidants, beta-1-agonists (for cardiovascular indication), non-invasive ventilation, long term oxygen therapy and can have Cor Pulmonale.

Entity relations:
- AND("managed", "at home")
- multi("managed at home", "managed")
- multi("outpatients", "outpatients")
- Subsumes("managed at home", "outpatients")
- Subsumes("long-acting anticholinergics", "tiotropium")
- AND("beta-1-agonists", "cardiovascular indication")
- Subsumes("non-invasive ventilation", "beta-1-agonists")
- multi("oxygen therapy", "oxygen")
- Has_multiplier("oxygen therapy", "long term")
- OR("COPD medication", "vaccines", "inhaled short-acting beta-2-agonists", "short-acting", "long-acting anticholinergics", "systemic beta-2-agonists", "theophylline", "mucolytics", "antioxidants")
- OR("non-invasive ventilation", "Cor Pulmonale", "oxygen therapy")